有關食道癌之敘述，下列何者錯誤？
A. 目前全世界之食道癌以鱗狀細胞癌（squamous cell carcinoma）最常見
B. 在西方國家，制酸劑使用增加是食道癌的危險因子之一
C. 與食道遲緩不能（achalasia）有關的食道癌，最常見的細胞型態為腺癌（adenocarcinoma）
D. 評估術前淋巴轉移（N status for TNM stage, AJCC）的非侵犯性工具當中，正子攝影的正確性比電腦斷層佳

正確答案：C. 與食道遲緩不能（achalasia）有關的食道癌，最常見的細胞型態為腺癌（adenocarcinoma）